The patient is in an exclusion period determined by a previous study

The above is a clinical trial exclusion criterion. Annotated with entity spans:
[Non-query-able: The patient is in an exclusion period determined by a previous study]